History of prior stroke

The above is a clinical trial exclusion criterion. Annotated with entity spans:
History of [Temporal: prior] [Condition: stroke]